下列何者不是非發炎性關節液（non-inflammatory synovial fluid）的特徵？
A. 黏蛋白凝固（mucin clot）佳
B. 多形核白血球之比率＜25%
C. 白血球數目高於2000/mm3
D. 黏綢度（viscosity）高

正確答案：C. 白血球數目高於2000/mm3